Clinical trial exclusion criterion:
History of being treated for tuberculosis in the prior 2 years unless there is DST, including PCR testing, showing sensitivity to rifamycin.

Annotated entities:
- Procedure: "treated"
- Condition: "tuberculosis"
- Temporal: "in the prior 2 years"
- Procedure: "PCR testing"
- Condition: "sensitivity"
- Drug: "rifamycin"
- Condition: "DST"